Subject must be at least 30 years of age.

The above is a clinical trial inclusion criterion. Annotated with entity spans:
Subject must be [Value: at least 30 years] of [Person: age].